Clinical trial inclusion criterion:
Absence of untreated caries.

Annotated entities:
- Qualifier: "untreated"
- Condition: "caries"
- Negation: "Absence"